unable to lie flat on the scanner for extended periods of time

The above is a clinical trial exclusion criterion. Annotated with entity spans:
[Post-eligibility: unable to lie flat on the scanner for extended periods of time]